¿Qué Escuela de Enfermeras en España siguió en sus inicios el modelo de formación de Nightingale?:
1. La Escuela de Enfermeras de Santa Isabel de Hungría.
2. La Escuela de Enfermeras de Santa Madrona.
3. La Escuela de Enfermeras de la “Casa de Salud Valdecilla”.
4. La Escuela de Enfermeras de la Cruz Roja.

Respuesta correcta: 3. La Escuela de Enfermeras de la “Casa de Salud Valdecilla”.